Clinical trial exclusion criterion:
systemic conditions associated with chronic pain

Entity relations:
- multi("associated with chronic pain", "chronic pain")
- Has_qualifier("systemic conditions", "associated with chronic pain")